Clinical trial inclusion criterion:
early to moderate stage diabetic retinopathy (ETDRS: 20 (microaneurysms only) to 35 (microaneurysms/ hemorrhages and/or hard exsudates)) in one or both eyes

Annotated entities:
- Condition: "diabetic retinopathy"
- Qualifier: "early"
- Qualifier: "moderate stage"
- Measurement: "ETDRS"
- Value: "20"
- Value: "35"
- Qualifier: "eyes"